Clinical trial exclusion criterion:
corticosteroid use during last 3 months

Entity relations:
- Has_temporal("corticosteroid", "during last 3 months")